• Dactylitis (physician-diagnosed)

The above is a clinical trial inclusion criterion. Annotated with entity spans:
• [Condition: Dactylitis] (physician-diagnosed)